雙峰脈（pulsus bisferiens）不常見於下列何種疾病？
A. 主動脈瓣閉鎖不全（aortic regurgitation）
B. 主動脈瓣閉鎖不全併狹窄（aortic regurgitation with accompanying stenosis）
C. 僧帽瓣閉鎖不全（mitral regurgitation）
D. 肥厚性心肌症（hypertrophic cardiomyopathy）

正確答案：C. 僧帽瓣閉鎖不全（mitral regurgitation）